Clinical trial exclusion criterion:
Severe liver disease (including ALT or AST=2.5-fold the normal upper limit), biliary obstruction;

Entity relations:
- Has_qualifier("liver disease", "Severe")
- Has_value("ALT", "=2.5-fold the normal upper limit")
- Subsumes("liver disease", "ALT")
- AND("liver disease", "biliary obstruction")
- OR("ALT", "AST")